Clinical trial exclusion criterion:
Exclusion criteria are pregnancy, patients with contraindications to regional anesthesia, allergy to LAs, patients taking opioids regularly due to chronic pain, use of anticoagulation drugs other than acetylsalicylic acid or dipyridamole, atrioventricular block, diabetes.

Entity relations:
- AND("allergy", "LAs")
- AND("opioids", "chronic pain")
- Has_multiplier("opioids", "regularly")
- Has_negation("acetylsalicylic acid", "other than")
- AND("anticoagulation drugs", "acetylsalicylic acid")
- AND("contraindications", "regional anesthesia")
- OR("acetylsalicylic acid", "dipyridamole")
- OR("pregnancy", "diabetes", "anticoagulation drugs", "opioids", "allergy", "contraindications", "atrioventricular block")